Clinical trial exclusion criterion:
Cardiac disease (congenital or acquired)

Entity relations:
- Subsumes("Cardiac disease", "congenital")
- OR("congenital", "acquired")